age > 18 years

The above is a clinical trial inclusion criterion. Annotated with entity spans:
[Person: age] [Value: > 18 years]